有關骨骼肌收縮時的敘述，下列何者正確？
A. I 帶不變，A 帶變短
B. I 帶變短，A 帶不變
C. I 帶變短，A 帶變長
D. I 帶變長，A 帶變短

正確答案：B. I 帶變短，A 帶不變